Clinical trial exclusion criterion:
Pregnant or lactating women, women of childbearing potential not employing adequate contraception

Entity relations:
- Has_negation("contraception", "not employing")
- OR("Pregnant", "lactating", "childbearing potential")